下列何種藥物可以用來治療垂體性尿崩症（pituitary diabetes insipidus）？
A. Atosiban
B. Desmopressin
C. Conivaptan
D. Oxytocin

正確答案：B. Desmopressin